4. Pregnancy

The above is a clinical trial exclusion criterion. Annotated with entity spans:
[Parsing_Error: 4.] [Condition: Pregnancy]